在某些蛋白質中含有-Ser-Gly-Pro-Gly-的胺基酸序列，最有可能形成下列何種蛋白質的二級結構？
A. β-turn
B. α-helix
C. β-sheet
D. zinc finger

正確答案：A. β-turn